History of AP above ULN for at least six months

The above is a clinical trial inclusion criterion. Annotated with entity spans:
History of [Measurement: AP] [Value: above ULN] [Temporal: for at least six months]